Clinical trial exclusion criterion:
Hypersensitivity to local anesthetics and/or Dexamethasone.

Annotated entities:
- Condition: "Hypersensitivity"
- Drug: "local anesthetics"
- Drug: "Dexamethasone"